Clinical trial inclusion criterion:
Right proficient oral and written language.

Annotated entities:
- Post-eligibility: "Right proficient oral and written language"